Between the age of 25 to 65 at baseline

The above is a clinical trial inclusion criterion. Annotated with entity spans:
[Value: Between] the [Person: age] of 25 to 65 [Temporal: at baseline]